Clinical trial inclusion criterion:
Women at any age with early stage breast cancer (stage I-II) and American Society of Anesthesiologists (ASA) score of I-II.

Entity relations:
- Has_value("stage", "early")
- Has_value("stage", "I-II")
- Has_value("American Society of Anesthesiologists (ASA) score", "I-II")
- Subsumes("stage", "stage")
- AND("breast cancer", "stage")
- AND("breast cancer", "American Society of Anesthesiologists (ASA) score")